Clinical trial inclusion criterion:
Male or female of aged 50 years or older

Entity relations:
- Has_value("aged", "50 years or older")
- OR("Male", "female")